Clinical trial exclusion criterion:
Cardiogenic shock, ventricular arrhythmia or resuscitated cardiac arrest

Annotated entities:
- Condition: "Cardiogenic shock"
- Condition: "ventricular arrhythmia"
- Condition: "cardiac arrest"
- Qualifier: "resuscitated"